Clinical trial exclusion criterion:
previous brain surgery;

Entity relations:
- Has_temporal("brain surgery", "previous")